下列有關尿路結石的敘述，何者錯誤？
A. 如果不積極預防，其 5 年再發率可高達 50%
B. 各種結石之命名來源不相同，例如磷酸銨鎂結石之俗名 struvite stone 即以一蘇俄礦石學家來命名
C. 當今解釋結石成因之理論已完備；亦即需結晶（crystal）及基質（matrix）即可形成結石
D. 結石成長除了離子飽和外，亦有抑制成長之因素，例如：鎂（magnesium），檸檬酸鹽（citrate）等

正確答案：C. 當今解釋結石成因之理論已完備；亦即需結晶（crystal）及基質（matrix）即可形成結石